thrombus in the LA or LAA;

The above is a clinical trial exclusion criterion. Annotated with entity spans:
[Condition: thrombus] in the [Qualifier: LA] or [Qualifier: LAA];